Clinical trial exclusion criterion:
Severe or uncontrolled medical conditions that could compromise study participation

Annotated entities:
- Condition: "medical conditions"
- Qualifier: "compromise study participation"
- Post-eligibility: "Severe or uncontrolled medical conditions that could compromise study participation"